Clinical trial exclusion criterion:
Previous coronary artery bypass graft surgery within the previous 6 months

Annotated entities:
- Temporal: "within the previous 6 months"
- Procedure: "coronary artery bypass graft surgery"
- Temporal: "Previous"